Clinical trial exclusion criteria:
Patients will be excluded if they have known middle ear disease, chronic lung disease or claustrophobia

Annotated entities:
- Condition: "middle ear disease"
- Condition: "chronic lung disease"
- Condition: "claustrophobia"